Clinical trial exclusion criterion:
No frozen embryos after IVF cycle

Entity relations:
- Has_negation("frozen embryos", "No")
- Has_context("IVF cycle", "frozen embryos")